recurrent contracture in the finger to be treated

The above is a clinical trial exclusion criterion. Annotated with entity spans:
[Qualifier: recurrent] [Condition: contracture] in the [Qualifier: finger to be treated]